Clinical trial exclusion criterion:
Contraindication for adalimumab

Entity relations:
- AND("Contraindication", "adalimumab")